Who are pregnant or planning to become pregnant during the study or in the future

The above is a clinical trial exclusion criterion. Annotated with entity spans:
Who are [Condition: pregnant] or [Mood: planning to become] [Condition: pregnant] [Temporal: during the study] or [Temporal: in the future]